媽媽帶一位 6 歲小朋友至門診求診，主訴疲倦合併腹痛，身體診查發現下肢有紫紅色之皮疹，眼瞼及陰囊水腫。下列敘述何者錯誤？
A. 皮疹可能持續數天至數週
B. 部分病童會合併關節痛，以膝及踝關節最為常見
C. 約 25%至 50%的病童會有血尿或蛋白尿，需定期追蹤尿液檢查
D. 常見血小板低下及 IgA 升高

正確答案：D. 常見血小板低下及 IgA 升高